35歲男性從高處跌落，造成背部嚴重疼痛及下肢無力，且從身體乳線（nipple line）以下有感覺異常情形。初步診斷為脊椎骨折脊髓損傷。經理學檢查，此患者最可能的脊髓損傷部位？
A. 第四胸椎（T4）
B. 第八胸椎（T8）
C. 第十胸椎（T10）
D. 第十二胸椎（T12）

正確答案：A. 第四胸椎（T4）